Clinical trial exclusion criterion:
Subject is pregnant (documented by a positive pregnancy test) or is actively breast-feeding.

Annotated entities:
- Condition: "pregnant"
- Value: "positive"
- Measurement: "pregnancy test"
- Qualifier: "actively"
- Temporal: "actively"
- Observation: "breast-feeding"